穀胱甘肽（glutathione）為人體內調節氧化還原之重要物質，下列那一種胺基酸不是作為合成穀胱甘肽之主要骨架？
A. 麩胺酸（glutamate）
B. 離胺酸（lysine）
C. 半胱胺酸（cysteine）
D. 甘胺酸（glycine）

正確答案：B. 離胺酸（lysine）